Clinical trial exclusion criterion:
Ongoing dementia treatment or anti-depressive disorder medication

Annotated entities:
- Condition: "dementia"
- Procedure: "treatment"
- Drug: "anti-depressive disorder medication"
- Temporal: "Ongoing"